Subjects were not to have a postural drop of 20 mmHg or more in systolic blood pressure at screening.

The above is a clinical trial exclusion criterion. Annotated with entity spans:
Subjects were [Negation: not] to have a [Value: postural drop of 20 mmHg] or more in [Measurement: systolic blood pressure] [Temporal: at screening].